Height 150 - 180 cm

The above is a clinical trial inclusion criterion. Annotated with entity spans:
[Measurement: Height] [Value: 150 - 180 cm]